Clinical trial exclusion criterion:
Patients are acute intercurrent illness.

Annotated entities:
- Condition: "acute intercurrent illness"